alcoholism and drug dependence.

The above is a clinical trial exclusion criterion. Annotated with entity spans:
[Condition: alcoholism] and [Condition: drug dependence].